Subjects with topographic evidence of keratoconus.

The above is a clinical trial exclusion criterion. Annotated with entity spans:
Subjects with [Condition: topographic evidence] of [Condition: keratoconus].